Clinical trial exclusion criteria:
Paroxysmal atrial fibrillation.
Long-standing persistent or permanent atrial fibrillation.
Previous pacemaker implantation.
Previous atrial ablation.
Patient is unable to take warfarin or other oral anti-coagulant medication.
Patient is suffering with unstable angina in last one week.
Patient has had a myocardial infarction within last two months.
Patient is expecting or has had major cardiac surgery within last two months.
Patient is participating in a conflicting study.
Patient is unable to perform exercise testing.
Patient is mentally incapacitated and cannot consent or comply with follow-up.
Patient has New York Heart Association (NYHA) class III/IV heart failure.
Patient has left ventricular ejection fraction (LVEF) less than 35% not secondary to tachycardia.
Pregnancy.
Patient suffers with other cardiac rhythm disorders.
Recent coronary artery intervention or other factors suggesting clinical instability (ECG, clinical or laboratory findings).

Annotated entities:
- Condition: "Paroxysmal atrial fibrillation"
- Condition: "atrial fibrillation"
- Qualifier: "persistent"
- Qualifier: "permanent"
- Device: "pacemaker implantation"
- Procedure: "atrial ablation"
- Mood: "unable to take"
- Drug: "warfarin"
- Drug: "oral anti-coagulant medication"
- Condition: "unstable angina"
- Temporal: "last one week"
- Condition: "myocardial infarction"
- Temporal: "last two months"
- Procedure: "major cardiac surgery"
- Temporal: "last two months"
- Competing_trial: "Patient is participating in a conflicting study"
- Post-eligibility: "Patient is unable to perform exercise testing"
- Post-eligibility: "Patient is mentally incapacitated and cannot consent or comply with follow-up"
- Measurement: "New York Heart Association"
- Measurement: "NYHA"
- Value: "class III/IV"
- Condition: "heart failure"
- Measurement: "left ventricular ejection fraction"
- Measurement: "LVEF"
- Value: "less than 35%"
- Mood: "not secondary to"
- Condition: "tachycardia"
- Condition: "Pregnancy"
- Condition: "cardiac rhythm disorders"
- Qualifier: "other"
- Procedure: "coronary artery intervention"